Clinical trial inclusion criterion:
Histologically or cytologically confirmed adenocarcinoma of the breast with locally advanced or metastatic disease, and a candidate for chemotherapy.

Annotated entities:
- Qualifier: "cytologically confirmed"
- Qualifier: "Histologically confirmed"
- Condition: "adenocarcinoma of the breast"
- Condition: "metastatic disease"
- Condition: "disease locally advanced"
- Condition: "candidate for chemotherapy"
- Procedure: "chemotherapy"